Total bilirubin level exceeded 2 mg / dL

The above is a clinical trial exclusion criterion. Annotated with entity spans:
[Measurement: Total bilirubin level] [Value: exceeded 2 mg / dL]